Clinical trial inclusion criteria:
HbA1c > 13.0 %
No treatment with insulin or oral agents for 6 months
20 = Age < 80 years

Annotated entities:
- Measurement: "HbA1c"
- Value: "> 13.0 %"
- Negation: "No"
- Procedure: "treatment"
- Drug: "insulin"
- Drug: "oral agents"
- Temporal: "for 6 months"
- Value: "20 ="
- Person: "Age"
- Value: "< 80 years"